Patients who require intensive care unit treatment.

The above is a clinical trial exclusion criterion. Annotated with entity spans:
Patients who require [Visit: intensive care unit] treatment.